Clinical trial exclusion criterion:
Patients with severe organ dysfunction or failure

Entity relations:
- Has_qualifier("organ dysfunction", "severe")
- OR("organ dysfunction", "organ failure")